Clinical trial inclusion criterion:
Patients with osteoarthritis of the hip secondary to degeneration, inflammatory arthritis, gouty arthritis, acetabular dysplasia or osteonecrosis of the femoral head, and undergoing primary unilateral minimally invasive THA

Annotated entities:
- Condition: "osteoarthritis"
- Qualifier: "hip"
- Qualifier: "secondary to degeneration"
- Condition: "degeneration"
- Condition: "inflammatory arthritis"
- Condition: "gouty arthritis"
- Condition: "acetabular dysplasia"
- Condition: "osteonecrosis"
- Qualifier: "femoral head"
- Temporal: "undergoing"
- Qualifier: "primary"
- Qualifier: "unilateral"
- Procedure: "minimally invasive THA"